decompensated liver cirrhosis (Child-Pugh score above 6)

The above is a clinical trial exclusion criterion. Annotated with entity spans:
[Qualifier: decompensated] [Condition: liver cirrhosis] ([Measurement: Child-Pugh score] [Value: above 6])